What are invasomes

invasomes and core-multishell (CMS) nanotransporters are efficient drug delivery systems for dermatological applications.